Clinical trial inclusion criterion:
Absence of severe angina

Entity relations:
- Has_qualifier("angina", "severe")
- Has_negation("angina", "Absence of")